Clinical trial exclusion criteria:
Inability to consent/refusal Allergy to any of the study medications Multiple traumatic injuries Contraindication to neuraxial or general anesthesia Pregnancy

Annotated entities:
- Observation: "Inability to consent"
- Observation: "refusal"
- Line: "Inability to consent/refusal"
- Line: "Allergy to any of the study medications"
- Line: "Multiple traumatic injuries"
- Line: "Contraindication to neuraxial or general anesthesia"
- Line: "Pregnancy"
- Condition: "Allergy"
- Drug: "study medications"
- Condition: "Multiple traumatic injuries"
- Condition: "Contraindication"
- Procedure: "neuraxial anesthesia"
- Procedure: "general anesthesia"
- Condition: "Pregnancy"